Clinical trial inclusion criterion:
Non-ventilated Patients over the age of 65

Annotated entities:
- Person: "age"
- Value: "over 65"
- Procedure: "ventilated"
- Negation: "Non"